Biological parameters at the beginning of the study: leucocytes ³ 2000 elements per mm3, hemoglobin ³ 10.5g/dl, platelets ³ 100 000 per mm3, phosphatases alcalines transaminases £ 1 time 1/2 compared to the normal.

The above is a clinical trial inclusion criterion. Annotated with entity spans:
Biological parameters [Temporal: at the beginning of the study]: [Measurement: leucocytes] [Value: ³ 2000 elements per mm3], [Measurement: hemoglobin] [Value: ³ 10.5g/dl], [Measurement: platelets] [Value: ³ 100 000 per mm3], [Measurement: phosphatases alcalines transaminases] [Value: £ 1 time 1/2 compared to the normal].